Known or suspected gram-positive infection.

The above is a clinical trial inclusion criterion. Annotated with entity spans:
Known or suspected [Qualifier: gram-positive] [Condition: infection].